Clinical trial exclusion criterion:
Polycystic ovary syndrome (PCOS) according to Rotterdam Consensus Criteria (European Society of Human Reproduction and Embryology [ESHRE]/American Society for Reproductive Medicine [ASRM], 2003)

Entity relations:
- Subsumes("Rotterdam Consensus Criteria", "European Society of Human Reproduction and Embryology [ESHRE]/American Society for Reproductive Medicine [ASRM], 2003")
- Has_qualifier("Polycystic ovary syndrome (PCOS)", "Rotterdam Consensus Criteria")